¿Cuál de estos compuestos es un producto generado directamente por la ruta de las pentosas?
1. NADP+.
2. NADPH.
3. NADH.
4. Fructosa-1, 6-bisfosfato.
5. CoA.

Respuesta correcta: 2. NADPH.